Clinical trial exclusion criterion:
has ever taken Xyrem / sodium oxybate / GHB at any time

Entity relations:
- Has_temporal("Xyrem", "ever")
- OR("Xyrem", "GHB", "sodium oxybate")